55 歲男性周邊血液檢查白血球數為 240,000/µL，LAP score 為 3，且有費城染色體存在，則下列何種治療最為恰當？
A. Hydroxyurea
B. Interferon
C. Imatinib
D. Stem cell transplantation

正確答案：C. Imatinib